severe hepatic or renal dysfunction;

The above is a clinical trial exclusion criterion. Annotated with entity spans:
[Qualifier: severe] [Condition: hepatic] or [Condition: renal dysfunction];